運動員發生踝關節扭傷後，下列處置何者錯誤？
A. 以石膏固定 6 週是必要措施
B. 籃球與足球運動員可改穿高筒鞋（hightop shoes）
C. 貼紮（taping）治療對預防踝關節再扭傷有效
D. 腳踏車運動對踝關節扭傷後之耐力訓練有幫助

正確答案：A. 以石膏固定 6 週是必要措施